¿Qué acción llevaría a cabo si observa que en la cámara del sello hidráulico del drenaje torácico de un paciente, el agua asciende al inspirar y desciende al espirar?
1. Observar posibles acodamientos del sistema.
2. Comprobar el nivel de presión del manómetro de aspiración.
3. Ordeñar los tubos por si existe obstrucción.
4. Ninguna, ya que se trata de un hallazgo normal.
5. Vigilar que el sistema esté colocado en posición horizontal.

Respuesta correcta: 4. Ninguna, ya que se trata de un hallazgo normal.